Clinical trial inclusion criterion:
Diagnosis: Major depression, unipolar (by Structured Clinical Interview for Diagnostic and Statistical Manual (DSM)IV (SCID-R) and DSM-IV criteria);

Annotated entities:
- Condition: "Major depression"
- Qualifier: "unipolar"
- Measurement: "IV Structured Clinical Interview for Diagnostic and Statistical Manual"
- Measurement: "DSM-IV criteria)"
- Measurement: "DSM"
- Measurement: "SCID"